health status incompatible with detention in police cells

The above is a clinical trial exclusion criterion. Annotated with entity spans:
health status [Observation: incompatible with detention in police cells]